El tratamiento de 3-metilbutanal con hidróxido de sodio acuoso a 5ºC genera:
1. 3-Hidroxi-2, 6-dimetl-4-heptanona.
2. 2-Hidroxi-3-metilbutanal.
3. 2,6-Dimetil-3,4-heptanodiona.
4. 3-Hidroxi-2-isopropil-5-metilhexanal.

Respuesta correcta: 4. 3-Hidroxi-2-isopropil-5-metilhexanal.